Clinical trial inclusion criteria:
Over 18 years of age; Systemically healthy; Non-smoking;
With good oral hygiene;
Absent irreversible pulpal alteration;
With the presence of a non-carious cervical lesion (LCNCs) that needs to be restored. This lesion should be non-carious, non-retentive, with at least 1 mm and up to 3 mm depth, should involve both enamel and dentin of vital teeth without mobility, and present hypersensitivity;
Presence a natural tooth of the same position of the restored tooth, but in the opposite arch of the same jaw to be considered for the positive control;
Periodontal parameters : Depth Probing (PS), Visible Plaque Index (IPV), Gingival Index (GI) and Probing Bleed Index (SS). The normal included were: PS = 1 to 3 mm, GI = 0, IPV = score 0 e SS = score 0.

Annotated entities:
- Value: "Over 18 years"
- Person: "age"
- Condition: "Systemically healthy"
- Condition: "Non-smoking"
- Observation: "good oral hygiene"
- Condition: "irreversible pulpal alteration"
- Negation: "Absent"
- Condition: "non-carious cervical lesion (LCNCs)"
- Procedure: "restored"
- Mood: "needs to be"
- Condition: "lesion"
- Qualifier: "non-carious"
- Qualifier: "non-retentive"
- Value: "at least 1 mm and up to 3 mm"
- Measurement: "depth"
- Qualifier: "involve both enamel and dentin"
- Condition: "hypersensitivity"
- Non-representable: "Presence a natural tooth of the same position of the restored tooth, but in the opposite arch of the same jaw to be considered for the positive control;"
- Measurement: "Depth Probing (PS)"
- Measurement: "Visible Plaque Index (IPV)"
- Measurement: "Gingival Index (GI)"
- Measurement: "Probing Bleed Index (SS)"
- Measurement: "PS"
- Value: "= 1 to 3 mm"
- Value: "= 0"
- Value: "score 0"
- Value: "score 0"
- Measurement: "SS"
- Measurement: "IPV"
- Measurement: "GI"